20歲男性，近兩個月出現關節腫脹，間歇性發燒至39°C伴隨肌肉痠痛情形。發燒後軀幹出現鮭魚色的皮疹，全身檢查後沒有明顯的感染源，抽血檢查發現ANA(-)，rheumatoid factor (-)，ferritin > 10000 ng/ml，Anti-
A. 全身性紅斑性狼瘡（systemic lupus erythematosus）
B. 風濕性關節炎（rheumatoid arthritis）
C. 成人史迪爾氏病（adult onset Still's disease）
D. 混合性結締組織症（mixed connective tissue disease）

正確答案：C. 成人史迪爾氏病（adult onset Still's disease）